Has a known history of, or any evidence of, central nervous system (CNS) metastases and/or carcinomatous meningitis

The above is a clinical trial exclusion criterion. Annotated with entity spans:
Has a known [Temporal: history] of, or any [Observation: evidence] of, [Condition: central nervous system (CNS) metastases] and/or [Condition: carcinomatous meningitis]